2. CABG or Percutaneous Coronary Intervention (PCI) procedure;

The above is a clinical trial exclusion criterion. Annotated with entity spans:
2. [Procedure: CABG] or [Procedure: Percutaneous Coronary Intervention (PCI)] procedure;